Clinical trial exclusion criterion:
6. Legal blindness or severe visual impairment;

Annotated entities:
- Parsing_Error: "6."
- Condition: "severe visual impairment"
- Condition: "Legal blindness"